Which disease is treated with Fexinidazole?

Oral fexinidazole is effective for late-stage human african  trypanosomiasis.